Known allergy or hypersensitivity reaction to dexmedetomidine

The above is a clinical trial exclusion criterion. Annotated with entity spans:
Known [Condition: allergy] or [Condition: hypersensitivity] reaction to [Drug: dexmedetomidine]